微生物致病菌（microorganisms）侵入下呼吸道引發肺炎，最常見的侵入下呼吸道途徑是經由：
A. 吸入（aspiration）
B. 血行轉移（hematogeneous spread）
C. 淋巴轉移（lymphatic spread）
D. 肋膜侵入（pleural extension）

正確答案：A. 吸入（aspiration）